Clinical trial exclusion criterion:
Estimated life expectancy < 1 year from conditions other than TR.

Entity relations:
- Has_value("Estimated life expectancy", "< 1 year")